Clinical trial exclusion criterion:
Use of warfarin is prohibited. Anticoagulation with low-molecular weight heparin (i.e. enoxaparin) or direct thrombin inhibitors is permitted.

Entity relations:
- Subsumes("low-molecular weight heparin", "enoxaparin")
- AND("Anticoagulation", "low-molecular weight heparin")
- OR("low-molecular weight heparin", "direct thrombin inhibitors")